下列何者不是創傷初級評估中，會有立即生命危險之傷害？
A. 心包膜填塞症（cardiac tamponade）
B. 自發性氣胸（spontaneous pneumothorax）
C. 氣道阻塞（airway obstruction）
D. 連枷胸（flail chest）併肺挫傷（pulmonary contusion）

正確答案：B. 自發性氣胸（spontaneous pneumothorax）